Clinical trial inclusion criterion:
aspartate aminotransferase/alanine aminotransferase within 2 times the upper limit of normal range

Entity relations:
- Has_value("alanine aminotransferase", "within 2 times the upper limit of normal range")
- Has_value("aspartate aminotransferase", "within 2 times the upper limit of normal range")